Clinical trial inclusion criterion:
For patients: Burn injury exceeding 6-8 Total Burned Surface Area %

Entity relations:
- Has_value("Total Burned Surface Area", "exceeding 6-8 %")
- AND("patients", "Burn injury")
- AND("patients", "Total Burned Surface Area")